En la anorexia nerviosa, y en lo relativo a la función menstrual / reproductora, ¿cuál de las afirmaciones es cierta según los criterios del DSM-IV-TR?
1. La existencia de amenorrea es un criterio diagnóstico básico.
2. No consideramos que la amorrea es significativa hasta que la paciente no haya presentado la misma durante al menos un año.
3. La amorrea, cuando existe, siempre es primaria, nunca secundaria.
4. La amorrea es una característica de este trastorno pero no un criterio diagnóstico básico.
5. Sin la presencia de amorrea, se puede diagnosticar una anorexia nerviosa.

Respuesta correcta: 1. La existencia de amenorrea es un criterio diagnóstico básico.